Clinical trial exclusion criterion:
19. Any lesion that is located in a saphenous vein graft, however, lesions located within the native vessel but accessed through the graft are eligible.

Annotated entities:
- Device: "saphenous vein graft"
- Condition: "lesion"
- Qualifier: "located in a saphenous vein graft"
- Qualifier: "within the native vessel"
- Grammar_Error: "are eligible"
- Qualifier: "accessed through the graft"